Clinical trial exclusion criterion:
Short bowel syndrome that can cause inflammatory bowel disease (ulcerative colitis, Crohn's disease) and drug absorption disorder.

Annotated entities:
- Condition: "Short bowel syndrome"
- Condition: "inflammatory bowel disease"
- Mood: "can cause"
- Qualifier: "that can cause inflammatory bowel disease"
- Condition: "ulcerative colitis"
- Condition: "Crohn's disease"
- Condition: "drug absorption disorder"